Adequate renal function: Creatinine clearance <1.5 times ULN concurrent with creatinine clearance >50 ml/min.

The above is a clinical trial inclusion criterion. Annotated with entity spans:
[Value: Adequate] [Measurement: renal function]: [Measurement: Creatinine clearance] [Value: <1.5 times ULN] [Temporal: concurrent] with [Measurement: creatinine clearance] [Value: >50 ml/min].